Clinical trial exclusion criterion:
Submucous myoma.

Annotated entities:
- Condition: "Submucous myoma"